Patients who had taken PPI, H2 receptor antagonists and antibiotics within 4 weeks

The above is a clinical trial exclusion criterion. Annotated with entity spans:
Patients who had taken [Drug: PPI], [Drug: H2 receptor antagonists] [Grammar_Error: and] [Drug: antibiotics] [Temporal: within 4 weeks]